BRCA 1的基因變異與下列何種乳癌型態最相關？
A. 管腔A型（luminal A）
B. 管腔B型（luminal B）
C. 類基底型（basal-like）
D. HER-2過度表現型（HER-2 type）

正確答案：C. 類基底型（basal-like）